What is the function of the chromHMM software?

ChromHMM learns chromatin-state signatures using a multivariate hidden Markov model (HMM) that explicitly models the combinatorial presence or absence of each mark. It uses these signatures to generate a genome-wide annotation for each cell type by calculating the most probable state for each genomic segment.